Patients anticipated to receive metronidazole after enrollment.

The above is a clinical trial exclusion criterion. Annotated with entity spans:
Patients [Mood: anticipated] to receive [Drug: metronidazole] after enrollment.